Modafinil 屬於擬交感神經作用劑（sympathomimetics），可用於下列何種疾病？
A. 休克（shock）
B. 高血壓（hypertension）
C. 氣喘（asthma）
D. 嗜睡症（narcolepsy）

正確答案：D. 嗜睡症（narcolepsy）